Clinical trial inclusion criterion:
Subject must have been on maintenance therapy (Fixed dose combination ICS/LABA) for 3 months, cannot have changed dose in the month prior to screening and be able to change to an equivalent dose of RELVAR/BREO for the duration of the study. Other background asthma medication such as anti-leukotrienes and oral corticosteroids are permitted provided the dose has been stable for 1 month prior to screening.

Annotated entities:
- Procedure: "maintenance therapy"
- Multiplier: "Fixed dose"
- Drug: "combination ICS/LABA"
- Temporal: "for 3 months"
- Negation: "cannot"
- Multiplier: "changed dose"
- Temporal: "in the month prior to screening"
- Reference_point: "the month prior to screening"
- Non-representable: "and be able to change to an equivalent dose of RELVAR/BREO for the duration of the study. Other background asthma medication such as anti-leukotrienes and oral corticosteroids are permitted provided the dose has been stable for 1 month prior to screening"